beta blocker

The above is a clinical trial exclusion criterion. Annotated with entity spans:
[Drug: beta blocker]